Clinical trial inclusion criteria:
> 18 years old
Acute symptomatic BV
Signed informed consent
Insufficient knowledge of German
Illiteracy
Pregnancy
Acute illness
Known allergies against ingredients of the investigational products

Annotated entities:
- Value: "18 years"
- Person: "old"
- Temporal: "Acute"
- Qualifier: "symptomatic"
- Condition: "BV"
- Informed_consent: "Signed informed consent"
- Observation: "Insufficient knowledge of German"
- Observation: "Illiteracy"
- Condition: "Pregnancy"
- Condition: "Acute illness"
- Condition: "allergies"
- Drug: "ingredients of the investigational products"